Subjects who were hospitalized in the Geriatric Unit of the Emile Roux Hospital (AP-HP)

The above is a clinical trial inclusion criterion. Annotated with entity spans:
Subjects who were hospitalized in the [Visit: Geriatric Unit of the Emile Roux Hospital (AP-HP)]